Clinical trial exclusion criterion:
chronic use of pain medication

Entity relations:
- Has_multiplier("pain medication", "chronic use")